Clinical trial exclusion criteria:
HPN < 12 months
metabolically unstable
cancer as the reason for intestinal failure

Annotated entities:
- Measurement: "HPN"
- Value: "< 12 months"
- Condition: "metabolically unstable"
- Condition: "cancer"
- Condition: "intestinal failure"